A primary complaint of pain in the area between the 12th rib and buttock crease without leg pain

The above is a clinical trial inclusion criterion. Annotated with entity spans:
A primary complaint of [Condition: pain] in the [Qualifier: area between the 12th rib and buttock crease] [Negation: without] [Condition: leg pain]